Clinical trial inclusion criterion:
At least 20/200 corrected visual acuity

Entity relations:
- Has_value("corrected visual acuity", "At least 20/200")